攝食下列何者會使糞便常規檢查以過氧化酶法（peroxidase test）測定潛血時，出現偽陰性反應？
A. 豬肝
B. 瘦肉
C. 馬鈴薯
D. 維生素 C

正確答案：D. 維生素 C